Clinical trial exclusion criterion:
1. Use of any tobacco products.

Annotated entities:
- Parsing_Error: "1."
- Drug: "tobacco products"